Which is the main abnormality that arises with Sox9 locus duplication?

SOX9 duplication can cause XX sex reversal.  SOX9 duplication has been found to be a rare cause of 46,XX testicular DSD in humans.